Subject has been diagnosed with active hepatitis, AIDS, or HIV.

The above is a clinical trial exclusion criterion. Annotated with entity spans:
Subject has been diagnosed with [Qualifier: active] [Condition: hepatitis], [Condition: AIDS], or [Condition: HIV].